¿Qué nombre recibe la técnica empleada en el tratamiento del Trastorno de Ansiedad Generalizada (TAG) en la que se pide a la persona que suponga que su peor temor se cumple, y a continuación busque soluciones realistas al mismo?:
1. Guion del peor escenario.
2. Decatastrofización.
3. Afrontamiento de la incertidumbre.
4. Revaloración de la amenaza.
5. Procesamiento de la metapreocupación.

Respuesta correcta: 2. Decatastrofización.